Clinical trial exclusion criterion:
Clinically significant cardiac disease (New York Heart Association Class III/IV),or severe debilitating puhnonary disease.

Annotated entities:
- Condition: "cardiac disease"
- Measurement: "New York Heart Association"
- Value: "Class III/IV"
- Qualifier: "significant"
- Condition: "debilitating puhnonary disease"
- Qualifier: "severe"